Clinical trial exclusion criterion:
Blood platelet count<100,000/L

Entity relations:
- Has_value("Blood platelet count", "<100,000/L")